Clinical trial inclusion criterion:
IAP between 12 and 20 mmHg in at least two consecutive measurements within 1-12 h

Entity relations:
- Has_temporal("at least two consecutive measurements", "within 1-12 h")
- Has_value("IAP", "between 12 and 20 mmHg")
- Has_multiplier("IAP", "at least two consecutive measurements")